¿Cuál es la disfunción sexual más frecuente en varones?:
1. Trastorno del deseo hipoactivo.
2. Trastorno de erección.
3. Eyaculación precoz.
4. Trastorno orgásmico.

Respuesta correcta: 3. Eyaculación precoz.